Serum creatinine >2.5 mg/dL within 7 days of index procedure

The above is a clinical trial inclusion criterion. Annotated with entity spans:
[Measurement: Serum creatinine] [Value: >2.5 mg/dL] [Temporal: within 7 days of index procedure]